Clinical trial exclusion criterion:
Known history of/suspected malignant neoplasm of various sites.

Entity relations:
- Has_qualifier("malignant neoplasm", "various sites")
- Has_temporal("malignant neoplasm", "history of")
- OR("history of", "suspected")